Any cases giving clinical symptoms of gastritis e.g. nausea, vomiting, dull aching pain or soreness in the epigastrium.

The above is a clinical trial exclusion criterion. Annotated with entity spans:
Any cases giving [Mood: clinical symptoms] of [Condition: gastritis] e.g. [Condition: nausea], [Condition: vomiting], [Condition: dull aching pain] or [Condition: soreness in the epigastrium].